一位70歲退休教師，早年無任何精神疾病史，定期接受高血壓治療8年，因心臟不適住院治療，住院2天後突然出現話多、睡眠減少、夜間頻要求外出、自認有第六感可預知未來、晚上偶有視幻覺。 下列處置何者錯誤？
A. 宜評估是否有認知功能障礙
B. 宜排除任何生理相關之疾病
C. 晚上投與長效安眠藥物改善睡眠
D. 以抗精神病藥物為主要之藥物考量

正確答案：C. 晚上投與長效安眠藥物改善睡眠